Clinical trial exclusion criteria:
Infants who have already received postnatal vitamin D supplementation
prematurity (<37 weeks)/low birthweight <2500 g
poor health due to a current or past significant disease state or congenital abnormality.

Annotated entities:
- Person: "Infants"
- Procedure: "postnatal vitamin D supplementation"
- Drug: "vitamin D"
- Condition: "prematurity"
- Condition: "low birthweight"
- Measurement: "birthweight"
- Value: "<2500 g"
- Condition: "poor health"
- Temporal: "current"
- Temporal: "past"
- Condition: "significant disease state"
- Condition: "congenital abnormality"